Clinical trial inclusion criteria:
Women aged 20-49;
Having a regular menstrual cycle of which the menstrual period is between day 3-7, and the period between day 25-35;
Excluding internal and surgical disease (after having variety of physical examination such as electrocardiogram/hepatic and renal function/blood routine and urine routine).

Annotated entities:
- Person: "Women"
- Person: "aged"
- Value: "20-49"
- Condition: "regular menstrual cycle"
- Measurement: "menstrual period"
- Value: "between day 3-7"
- Grammar_Error: "and"
- Value: "between day 25-35"
- Condition: "internal disease"
- Condition: "surgical disease"
- Context_Error: "Excluding internal and surgical disease (after having variety of physical examination such as electrocardiogram/hepatic and renal function/blood routine and urine routine)"
- Undefined_semantics: "Excluding internal and surgical disease (after having variety of physical examination such as electrocardiogram/hepatic and renal function/blood routine and urine routine)."
- Non-query-able: "Excluding internal and surgical disease (after having variety of physical examination such as electrocardiogram/hepatic and renal function/blood routine and urine routine)."